Clinical trial exclusion criterion:
Eating Disorder (anorexia nervosa, bulimia)

Annotated entities:
- Condition: "Eating Disorder"
- Condition: "anorexia nervosa"
- Condition: "bulimia"